receiving medication that could interfere with the study protocol objectives (hormonal contraceptives, androgens, prednisone, thyroid hormones, insulin)

The above is a clinical trial exclusion criterion. Annotated with entity spans:
[Temporal: receiving] [Drug: medication] that [Qualifier: could interfere with the study protocol objectives] ([Drug: hormonal contraceptives], [Drug: androgens], [Drug: prednisone], [Drug: thyroid hormones], [Drug: insulin])